Contraindication or intolerance to evidence-based therapy for CHF, such as beta-blocker, angiotensin-converting enzyme inhibitor or angiotensin receptor blocker.

The above is a clinical trial exclusion criterion. Annotated with entity spans:
[Condition: Contraindication] or [Condition: intolerance] to [Procedure: evidence-based therapy] for [Condition: CHF], such as [Drug: beta-blocker], [Drug: angiotensin-converting enzyme inhibitor] or [Drug: angiotensin receptor blocker].